下列何種病人得到急性骨髓性白血病的機率不會較一般人高？
A. 唐氏症（Down syndrome）
B. 類風濕性關節炎（rheumatoid arthritis）
C. 長期接觸苯（benzene）
D. 過去用過 etoposide（VP-16）

正確答案：B. 類風濕性關節炎（rheumatoid arthritis）